Indique la respuesta correcta en relación al páncreas:
1. Sus células alfa secretan insulina.
2. Sus células F producen somatostatina, que acelera la secreción de glucagón.
3. Sus células alfa secretan glucagón, que aumenta la concentración de glucosa sanguínea.
4. Es una glándula exclusivamente endocrina.
5. Sus células delta secretan polipéptido pancreático.

Respuesta correcta: 3. Sus células alfa secretan glucagón, que aumenta la concentración de glucosa sanguínea.